Clinical trial exclusion criterion:
Patients who are making use of antidepressants, diuretics or anticoagulants;

Annotated entities:
- Drug: "antidepressants"
- Drug: "diuretics"
- Drug: "anticoagulants"